Clinical trial exclusion criteria:
Cases (with a history of TBI):
1. History of penetrating brain injury
2. History of disabling neurological or psychiatric condition such as epilepsy (besides posttraumatic epilepsy), multiple sclerosis, cortical stroke, hypoxic-ischemic encephalopathy, encephalitis, or schizophrenia
Controls (without a history of TBI):
History of disabling neurological or psychiatric condition such as epilepsy, multiple sclerosis, cortical stroke, hypoxic-ischemic encephalopathy, encephalitis, or schizophrenia

Annotated entities:
- Parsing_Error: "Cases (with a history of TBI):"
- Temporal: "History"
- Condition: "penetrating brain injury"
- Temporal: "History"
- Condition: "condition disabling neurological"
- Condition: "psychiatric condition disabling"
- Condition: "epilepsy"
- Condition: "posttraumatic epilepsy"
- Negation: "besides"
- Condition: "multiple sclerosis"
- Condition: "cortical stroke"
- Condition: "hypoxic-ischemic encephalopathy"
- Condition: "encephalitis"
- Condition: "schizophrenia"
- Undefined_semantics: "disabling neurological or psychiatric condition"
- Parsing_Error: "Controls (without a history of TBI):"
- Temporal: "History"
- Condition: "disabling neurological condition"
- Condition: "disabling psychiatric condition"
- Condition: "epilepsy"
- Condition: "multiple sclerosis"
- Condition: "cortical stroke"
- Condition: "hypoxic-ischemic encephalopathy"
- Condition: "encephalitis"
- Condition: "schizophrenia"